En relación con la simetría molecular, seleccione la afirmación correcta:
1. La molécula de agua, formada por tres átomos, pertenece al grupo puntual de simetría C3V.
2. La diferencia entre los grupos puntuales de simetría C2h y D2h es que el segundo implica la presencia de cuatro ejes binarios perpendiculares al eje C2.
3. La operación de simetría rotación impropia de orden n supone una rotación de 360/n grados seguida de una reflexión respecto a un plano perpendicular al eje de esta rotación.
4. Los grupos cúbicos de simetría tienen un único eje principal de simetría.

Respuesta correcta: 3. La operación de simetría rotación impropia de orden n supone una rotación de 360/n grados seguida de una reflexión respecto a un plano perpendicular al eje de esta rotación.